Able to provide written informed consent and to comply with study procedures.

The above is a clinical trial inclusion criterion. Annotated with entity spans:
[Non-query-able: Able to provide written informed consent and to comply with study procedures.]